Clinical trial inclusion criterion:
An Eastern Cooperative Oncology Group (ECOG) performance status of 0 or 1

Annotated entities:
- Measurement: "Eastern Cooperative Oncology Group performance status"
- Measurement: "ECOG"
- Value: "0 or 1"